Clinical trial exclusion criterion:
Patients with positive HIV status

Annotated entities:
- Value: "positive"
- Measurement: "HIV status"